78 歲的林先生最近 10 年內因慢性阻塞性肺病之急性發作多次住院。最近 3 天因呼吸逐漸窘迫而被家屬送至急診就醫。理學檢查呈現輕度嗜睡狀態，肺部聽診有瀰漫性喘鳴、痰量不多，動脈血氣體分析pH = 7.33、PCO2 = 72 mmHg、PO2 = 47 mmHg，家屬主張積極治療，則下列何者為最優先之處置方式？
A. 由鼻管給予氧氣，流速 1-2 公升/分鐘
B. 使用Venturi mask，FIO2 = 28%
C. 使用非侵襲性呼吸器治療（Bi-PAP）
D. 立刻氣切插管，使用呼吸器治療

正確答案：C. 使用非侵襲性呼吸器治療（Bi-PAP）